懷孕時乳房最可能發生何種變化？
A. 間質纖維化（stromal fibrosis）
B. 乳管上皮鱗狀化生（ductal epithelium squamous metaplasia）
C. 腺泡細胞異生（acinic cell dysplasia）
D. 小葉增生（lobular hyperplasia）

正確答案：D. 小葉增生（lobular hyperplasia）